Clinical trial exclusion criteria:
Medical history of chronic psychiatric disease
Medical conditions associated with female sexual dysfunction; cardiovascular disease, uncontrolled chronic HT (hypertension) ,DM (diabetes mellitus), History of gynecologic surgery, female gynecological cancer ( breast, ovarian, uterine, cervical)
Medications associated with female sexual dysfunction; Antidepressants opiates, beta blockers, Antiepileptics ( gabapentin, topiramate,phenytoin) benzodiazepines

Annotated entities:
- Temporal: "history"
- Condition: "chronic psychiatric disease"
- Condition: "female sexual dysfunction"
- Condition: "Medical conditions"
- Qualifier: "associated with female sexual dysfunction"
- Condition: "cardiovascular disease"
- Qualifier: "uncontrolled"
- Qualifier: "chronic"
- Condition: "HT"
- Condition: "hypertension"
- Condition: "DM"
- Condition: "diabetes mellitus"
- Procedure: "gynecologic surgery"
- Condition: "female gynecological cancer"
- Condition: "breast"
- Condition: "ovarian"
- Condition: "uterine"
- Condition: "cervical"
- Temporal: "History"
- Condition: "female sexual dysfunction"
- Drug: "Medications"
- Qualifier: "associated with female sexual dysfunction"
- Drug: "Antidepressants"
- Drug: "opiates"
- Drug: "beta blockers"
- Drug: "Antiepileptics"
- Drug: "gabapentin"
- Drug: "topiramate"
- Drug: "phenytoin"
- Drug: "benzodiazepines"